下列有關小兒肺臟移植（Pediatric lung transplantation）之敘述，何者有誤？
A. 常見之 surgical indication 為 end-stage pulmonary vascular disease 以及 end-stage bronchopulmonary pathology
B. 施行單側肺臟移植手術時，不一定需要使用體外循環心肺輔助機（cardiopulmonary bypass）
C. 移植術後早期常見之死亡原因為 bronchiolitis obliterans，而晚期常見之死亡原因則為 infection
D. 術後 Post-transplant lymphoproliferative disease 發生率約為 10%，與 Epstein-Barr virus 感染有關

正確答案：C. 移植術後早期常見之死亡原因為 bronchiolitis obliterans，而晚期常見之死亡原因則為 infection